Blood transfusion within 4 weeks prior to Screening

The above is a clinical trial exclusion criterion. Annotated with entity spans:
[Procedure: Blood transfusion] [Temporal: within 4 weeks prior to Screening]